Clinical trial exclusion criterion:
Administration of HES, dextrane solutions or > 500 ml of Gelatin solutions within the 24 h prior to randomization

Annotated entities:
- Drug: "HES"
- Drug: "dextrane solutions"
- Multiplier: "> 500 ml"
- Drug: "Gelatin solutions"
- Temporal: "within the 24 h prior to randomization"